Clinical trial inclusion criteria:
Men and women aged > 18 years
Angiographically confirmed acute massive pulmonary embolism with involvement of Central pulmonary arteries.
endovascular mechanical thrombus fragmentation + thrombolytic therapy (using recombinant tissue activator of plasminogen), performed for treatment of the above-mentioned pulmonary embolism in less than 48 hours before randomization. The patient should be randomized no earlier than 24 hours after procedures endovascular mechanical thrombus fragmentation + thrombolytic therapy
Written informed consent signed by patient.

Annotated entities:
- Person: "Men"
- Person: "women"
- Person: "aged"
- Value: "> 18 years"
- Procedure: "Angiographically"
- Qualifier: "Angiographically confirmed"
- Qualifier: "acute"
- Qualifier: "massive"
- Condition: "pulmonary embolism"
- Condition: "involvement of Central pulmonary arteries"
- Condition: "endovascular mechanical thrombus fragmentation"
- Procedure: "thrombolytic therapy"
- Drug: "recombinant tissue activator of plasminogen"
- Temporal: "in less than 48 hours before randomization"
- Procedure: "treatment"
- Condition: "pulmonary embolism"
- Non-representable: "The patient should be randomized no earlier than 24 hours after procedures endovascular mechanical thrombus fragmentation + thrombolytic therapy"
- Post-eligibility: "ritten informed consent signed by patient"